Clinical trial inclusion criterion:
Patients age 8- 18 years 2) Patients undergoing minimally invasive pectus excavatum repair via Nuss procedure 3) American Society of Anesthesiology Status I-III

Annotated entities:
- Person: "age"
- Value: "8- 18 years"
- Line: "2) Patients undergoing minimally invasive pectus excavatum repair via Nuss procedure"
- Line: "3) American Society of Anesthesiology Status I-III"
- Procedure: "minimally invasive pectus excavatum repair"
- Qualifier: "Nuss procedure"
- Measurement: "American Society of Anesthesiology Status"
- Value: "I-III"